神經皮膚症候群（neurocutaneous syndrome）患童有其特異性皮膚表徵，下列之對應組合，何者最不可能？
A. 色素失調症（incontinentia pigmenti）－鯊魚皮斑（shagreen patch）
B. Sturge-Weber syndrome－三叉神經分布範圍有紅葡萄酒斑（port-wine stain）
C. 結節性硬化症（tuberous sclerosis complex）－脫色斑（ash leaf hypomelanotic macules）
D. 神經纖維瘤症（von Recklinghausen syndrome）－咖啡牛奶斑（café-au-lait spots）

正確答案：A. 色素失調症（incontinentia pigmenti）－鯊魚皮斑（shagreen patch）